4. WHO clinical classification Groups 2-5

The above is a clinical trial exclusion criterion. Annotated with entity spans:
[Parsing_Error: 4.] [Measurement: WHO clinical classification] [Value: Groups 2-5]